Clinical trial exclusion criterion:
the sound-side (contralateral) lower extremity must be free of impediments that affect gait, range of motion, or limb muscle activity

Entity relations:
- Has_negation("impediments that affect gait", "free")
- Has_context("impediments that affect gait", "lower extremity")
- OR("impediments that affect gait", "impediments that affect range of motion", "impediments that affect limb muscle activity")